History of pancreatitis

The above is a clinical trial exclusion criterion. Annotated with entity spans:
[Temporal: History of] [Condition: pancreatitis]